Clinical trial exclusion criterion:
previous spine fusion surgery

Entity relations:
- Has_temporal("spine fusion surgery", "previous")